慢性便秘之手術適應症，通常不包括：
A. Paradoxic puborectalis
B. Adult Hirschsprung's disease
C. Chagas' disease
D. Rectocele over 2 cm

正確答案：A. Paradoxic puborectalis